Which is the main protein in brown adipose tissue (BAT) active in thermogenesis?

Uncoupling protein 1 (UCP1) is the hallmark protein responsible for cold- and diet-induced thermogenesis in brown adipose tissue (BAT).